El complejo ARP2/3:
1. Es un agente nucleador de filamentos intermedios.
2. Se localiza en el centrosoma.
3. Es responsable de la ramificación de los filamentos de actina.
4. Forma parte de la lámina nuclear.
5. Interviene en la formación de vesículas de transporte.

Respuesta correcta: 3. Es responsable de la ramificación de los filamentos de actina.